What is the mode of administration of Ubrogepant?

Ubrogepant (MK-1602) is administered orally.